Clinical trial exclusion criterion:
Sensistivity/allergy against anesthetic agents

Annotated entities:
- Condition: "Sensistivity"
- Condition: "allergy"
- Drug: "anesthetic agents"